Treatment with cyclophosphamide, leflunomide, or methotrexate for over 2 weeks, or use of biological agent(s) regardless of duration, within the past 6 months (Note: prior use of azathioprine, mizoribine, intravenous immunoglobulins and anti-malarials is allowed).

The above is a clinical trial exclusion criterion. Annotated with entity spans:
Treatment with [Drug: cyclophosphamide], [Drug: leflunomide], or [Drug: methotrexate] for over [Multiplier: 2 weeks], or use of [Procedure: biological agent](s) regardless of duration, within the [Temporal: past 6 months] (Note: prior use of [Drug: azathioprine], [Drug: mizoribine], intravenous [Drug: immunoglobulins] and [Drug: anti-malarials] is [Negation: allowed]).